Clinical trial inclusion criteria:
Clinical and radiologic diagnosis of primary knee osteoarthritis (Kellgren & Lawrence I, II or III);
Capability to understand the Informed Consent Form;
Chronic pain for at least 3 months prior to inclusion, measured by VAS. (VAS 4 or above);
Absence of skin injures, infections or tumor in the target knee;
Availability to comply with the visits.

Annotated entities:
- Condition: "primary knee osteoarthritis"
- Measurement: "Kellgren & Lawrence"
- Value: "I, II or III"
- Qualifier: "Clinical diagnosis"
- Qualifier: "radiologic diagnosis"
- Non-query-able: "Capability to understand the Informed Consent Form;"
- Post-eligibility: "Capability to understand the Informed Consent Form;"
- Condition: "Chronic pain"
- Temporal: "at least 3 months prior"
- Reference_point: "inclusion"
- Procedure: "VAS"
- Qualifier: "measured by VAS"
- Measurement: "VAS"
- Value: "4 or above"
- Parsing_Error: "(VAS 4 or above);"
- Condition: "skin injures"
- Negation: "Absence"
- Condition: "infections"
- Condition: "tumor"
- Reference_point: "target knee"
- Non-query-able: "Availability to comply with the visits"
- Post-eligibility: "Availability to comply with the visits"